Clinical trial exclusion criterion:
history of hypertension

Entity relations:
- Has_temporal("hypertension", "history")